Austrian syndrome is a rare entity characterized by Osler's triad. Please list the 3 components of Osler's triad.

Austrian syndrome, which is also known as Osler's triad, is a rare aggressive pathology consisting of pneumonia, endocarditis, and meningitis caused by Streptococcus pneumoniae.